a radiographically confirmed hip fracture

The above is a clinical trial inclusion criterion. Annotated with entity spans:
a [Procedure: radiographically] confirmed [Condition: hip fracture]